Which algorithm has been developed for finding conserved non-coding elements (CNEs)?

CNEFinder is an algorithm which has been developed for finding conserved non-coding elements (CNEs).